Informed consent available

The above is a clinical trial inclusion criterion. Annotated with entity spans:
[Non-query-able: Informed consent available]